Clinical trial exclusion criterion:
Known untreated B12 deficiency or malnutrition (body mass index [BMI] less than 18) at screening

Annotated entities:
- Qualifier: "untreated"
- Condition: "B12 deficiency"
- Condition: "malnutrition"
- Measurement: "body mass index [BMI]"
- Value: "less than 18"
- Temporal: "at screening"